Clinical trial inclusion criterion:
Estimated life expectancy of more than 3 months

Entity relations:
- Has_value("Estimated life expectancy", "more than 3 months")